Clinical trial exclusion criterion:
more or equal to American Society of Anesthesiologist (ASA) class III

Entity relations:
- Has_value("American Society of Anesthesiologist (ASA) class", "III more or equal to")